Predominance of central apneas and hypopneas, defined as more than 25% of all respiratory events.

The above is a clinical trial exclusion criterion. Annotated with entity spans:
[Condition: Predominance] of [Condition: central apneas and hypopneas], defined as [Value: more than 25%] of [Measurement: all respiratory events].